Uncorrected obstructive or severe regurgitant valve disease, nondilated cardiomyopathy, or significant systemic ventricular outflow obstruction

The above is a clinical trial exclusion criterion. Annotated with entity spans:
[Qualifier: Uncorrected] [Condition: obstructive] or [Qualifier: severe] [Condition: regurgitant valve disease], [Condition: nondilated cardiomyopathy], or [Qualifier: significant] [Condition: systemic ventricular outflow obstruction]